Clinical trial exclusion criterion:
Women who are pregnant will also be excluded from the study by performing 2 point of care urine pregnancy tests ( prior to vaccinations)

Annotated entities:
- Person: "Women"
- Condition: "pregnant"
- Procedure: "point of care urine pregnancy tests"
- Multiplier: "2"
- Temporal: "prior to vaccinations"
- Procedure: "vaccinations"
- Reference_point: "vaccinations"